Signed study-specific consent form

The above is a clinical trial inclusion criterion. Annotated with entity spans:
[Informed_consent: Signed study-specific consent form]